下列何者免疫抑制劑與FKBP-12接合，可減少IL-2之產生？
A. cyclosporine
B. tacrolimus
C. mycophenolate mofetil
D. sirolimus

正確答案：B. tacrolimus